presence of fistula or abscess near the selected tooth

The above is a clinical trial exclusion criterion. Annotated with entity spans:
presence of [Condition: fistula] or [Condition: abscess] [Qualifier: near the selected tooth]